Clinical trial exclusion criterion:
Has a history of known demyelinating diseases such as multiple sclerosis or optic neuritis

Entity relations:
- Has_temporal("demyelinating diseases", "history")
- Subsumes("demyelinating diseases", "multiple sclerosis")
- OR("multiple sclerosis", "optic neuritis")